Clinical trial exclusion criterion:
Acute coronary syndrome

Annotated entities:
- Condition: "Acute coronary syndrome"